Clinical trial inclusion criteria:
Aged at least 18 years
The presence of a solid, malignant tumour, excluding lymphoma, that is resistance to standard therapies or for which no standard therapies exist
The presence of at least one lesion that can be accurately assessed at baseline by Computerised Tomography (CT), Magnetic Resonance Imaging (MRI) or plain X-ray and is suitable for repeated assessment
Estimated life expectancy of more than 12 weeks

Annotated entities:
- Value: "at least 18 years"
- Person: "Aged"
- Condition: "solid, malignant tumour"
- Condition: "lymphoma"
- Negation: "excluding"
- Qualifier: "resistance to standard therapies"
- Qualifier: "for which no standard therapies exist"
- Multiplier: "at least one"
- Condition: "lesion"
- Qualifier: "accurately assessed at baseline"
- Procedure: "Computerised Tomography (CT)"
- Procedure: "Magnetic Resonance Imaging (MRI)"
- Procedure: "plain X-ray"
- Qualifier: "suitable for repeated assessment"
- Value: "more than 12 weeks"
- Observation: "Estimated life expectancy"